下列何者最可能引起 transudative pleural effusion？
A. 肺結核（tuberculosis）
B. 類肉瘤（sarcoidosis）
C. 尿毒症（uremia）
D. 肺栓塞（pulmonary embolism）

正確答案：D. 肺栓塞（pulmonary embolism）